溝通技巧中，傾聽病人之好處，下列何者除外？
A. 病人與醫師之間的聯繫更緊密
B. 醫療照顧者滿意度較高
C. 可減少醫療過失的危險
D. 比較沒有時間可做診斷

正確答案：D. 比較沒有時間可做診斷